Researchers consider patients inappropriate to participate in the registry.

The above is a clinical trial exclusion criterion. Annotated with entity spans:
[Non-query-able: Researchers consider patients inappropriate to participate in the registry.]